Clinical trial inclusion criterion:
Leukocytosis (>10.000 cells/mm3), leftward shift (>10%) or leucopenia (<4000 cells/mm3)

Entity relations:
- Has_multiplier("Leukocytosis", ">10.000 cells/mm3")
- Has_multiplier("leucopenia", "<4000 cells/mm3")
- Has_multiplier("Leukocytosis", "leftward shift >10%")
- OR("Leukocytosis", "leucopenia")